List off label uses for Rituximab.

Off label uses for rituximab are for poly- and dermatomyositis, multiple sclerosis, immune thrombocytopenia, systemic lupus erythematosus (SLE), lupus nephritis (LN), and other immune diseases.